Clinical trial inclusion criterion:
Ages 18-80

Entity relations:
- Has_value("Ages", "18-80")